Inpatient or outpatient age 8-19 years inclusive; participants must live with a parent, guardian, or caregiver;

The above is a clinical trial inclusion criterion. Annotated with entity spans:
[Person: Inpatient] or [Person: outpatient] [Person: age] [Value: 8-19 years] inclusive; [Non-query-able: participants must live with a parent, guardian, or caregiver];